Clinical trial exclusion criterion:
Participants who have been treated with testosterone in the past 6 months and for whom testosterone therapy is contraindicated

Annotated entities:
- Drug: "testosterone"
- Temporal: "in the past 6 months"
- Condition: "contraindicated"
- Procedure: "testosterone therapy"
- Drug: "testosterone"